Which CYP genes' expression is decreased at the in vivo level following pomegranate juice consumption?

It was found that pomegranate juice consumption decreased total hepatic CYP content as well as the expression of CYP1A2 and CYP3A.